Subject has hypertrophic cardiomyopathy.

The above is a clinical trial exclusion criterion. Annotated with entity spans:
Subject has [Condition: hypertrophic cardiomyopathy].